Purulent infection

The above is a clinical trial exclusion criterion. Annotated with entity spans:
[Condition: Purulent infection]